與情緒記憶最有關之腦區為：
A. 杏仁核（amygdaloid nucleus）
B. 海馬回（hippocampus）
C. 紋狀體（corpus striatum）
D. 小腦（cerebellum）

正確答案：A. 杏仁核（amygdaloid nucleus）